Clinical trial inclusion criterion:
Patients provided written informed consent;

Annotated entities:
- Observation: "provided written informed consent"